愛滋病（AIDS）之重要特徵為嚴重之免疫壓抑狀態，主要是表現下列何者之降低或喪失？
A. CD4+ T 淋巴球
B. CD8+ T 淋巴球
C. 巨噬細胞
D. B 淋巴球

正確答案：A. CD4+ T 淋巴球